下列何者不是新生兒臂神經叢受損（neonatal brachial plexus injuries）的危險因子？
A. 早產（prematurity）
B. 肩難產（shoulder dystocia）
C. 多產婦（multiparous mothers）
D. 高出生體重（大於4,500公克）

正確答案：A. 早產（prematurity）